A un niño hay que enseñarle a ser más autónomo y que aprenda a comer sin ayuda. Si primero aprende a sujetar una cuchara, luego a coger algo de puré y finalmente es capaz de llevárselo a la boca, y los padres le felicitan, significa que han utilizado el refuerzo positivo y la técnica de aproximaciones sucesivas. Esta técnica también se denomina:
1. Aprendizaje por observación.
2. Moldeamiento.
3. Aprendizaje vicario.
4. Recompensa.
5. Entrenamiento con emisión.

Respuesta correcta: 2. Moldeamiento.